Clinical trial exclusion criterion:
11. Systolic blood pressure < 90mmHg, or > 160mmHg;

Entity relations:
- OR("< 90mmHg", "> 160mmHg")